for which treatment with dimethyl-fumarate has been prescribed

The above is a clinical trial inclusion criterion. Annotated with entity spans:
for which treatment with [Drug: dimethyl-fumarate] has been prescribed